Clinical trial inclusion criterion:
History of chickenpox or positive test for antibodies against varicella zoster virus (VZV)

Entity relations:
- Subsumes("varicella zoster virus", "VZV")
- Has_qualifier("test for antibodies", "varicella zoster virus")
- Has_value("test for antibodies", "positive")
- OR("chickenpox", "test for antibodies")